Current severe depression (HAM-D >24) or anxiety (HAM-A >24)

The above is a clinical trial exclusion criterion. Annotated with entity spans:
[Temporal: Current] [Qualifier: severe] [Condition: depression] ([Measurement: HAM-D] [Value: >24]) or [Condition: anxiety] ([Measurement: HAM-A] [Value: >24])